Serum or plasma potassium level greater than or equal to 3.5 meq/L

The above is a clinical trial inclusion criterion. Annotated with entity spans:
[Qualifier: Serum] or [Qualifier: plasma] [Measurement: potassium level] [Value: greater than or equal to 3.5 meq/L]